Clinical trial inclusion criterion:
Documented history of chronic HCV RNA infection with Genotype 1

Entity relations:
- Has_qualifier("chronic HCV infection", "Genotype 1")